Renal disease that needs dialysis

The above is a clinical trial exclusion criterion. Annotated with entity spans:
[Condition: Renal disease] that [Mood: needs] [Procedure: dialysis]